Clinical trial exclusion criterion:
History of medically treated diabetes or of treated or medically diagnosed hypertension. Heterozygous subjects who have diagnosed hypertension and are well controlled on treatment (Refer to Exclusion Criteria 20 below), are eligible. .

Annotated entities:
- Condition: "diabetes"
- Qualifier: "medically treated"
- Drug: "medically"
- Procedure: "medically treated"
- Condition: "hypertension"
- Qualifier: "treated"
- Drug: "medically"
- Temporal: "History"
- Condition: "Heterozygous"
- Condition: "hypertension"
- Procedure: "treatment"
- Qualifier: "well controlled"
- Grammar_Error: "are eligible"
- Parsing_Error: "."